Clinical trial inclusion criterion:
= 50 years and in postmenopausal state > 1 year

Annotated entities:
- Person: "years"
- Value: "= 50"
- Observation: "postmenopausal state"
- Temporal: "> 1 year"